下列關於憂鬱症的非藥物治療，何者錯誤？
A. 光照療法
B. 睡眠剝奪
C. 迷走神經刺激
D. 眼動減敏與歷程更新療法（eye movement desensitization and reprocessing）

正確答案：D. 眼動減敏與歷程更新療法（eye movement desensitization and reprocessing）